History of sickle cell trait or disease or any other acquired or hereditary hematological abnormality

The above is a clinical trial exclusion criterion. Annotated with entity spans:
History of [Condition: sickle cell trait] or disease or any other [Condition: acquired] or [Condition: hereditary hematological abnormality]